Clinical trial exclusion criterion:
Any condition that prevents participation in the study, including pregnancy and other contraindications for Ventavis treatment (as listed in the current Ventavis Summary of Product Characteristics and patient package insert)

Entity relations:
- AND("contraindications", "Ventavis treatment")
- Subsumes("contraindications", "Ventavis Summary of Product Characteristics and patient package insert")
- OR("pregnancy", "contraindications")